Clinical trial inclusion criteria:
Pregnant gestational age >= 28 weeks
Systolic blood pressure >=160 mm Hg OR a diastolic blood pressure of >=110 mm Hg measured twice more than 15 minutes apart
Able to swallow pills
>= 18 years

Annotated entities:
- Measurement: "gestational age"
- Value: ">= 28 weeks"
- Measurement: "Systolic blood pressure"
- Value: ">=160 mm Hg"
- Measurement: "diastolic blood pressure"
- Value: ">=110 mm Hg"
- Non-query-able: "measured twice more than 15 minutes apart"
- Post-eligibility: "Able to swallow pills"
- Person: "years"
- Value: ">= 18"